tinnitus or hearing loss with same debut as vertigo

The above is a clinical trial exclusion criterion. Annotated with entity spans:
[Condition: tinnitus] or [Condition: hearing loss] with same debut as [Condition: vertigo]